Clinical trial exclusion criterion:
Blood Pressure =140/90 mmHg

Entity relations:
- Has_value("Blood Pressure", "=140/90 mmHg")